Clinical trial inclusion criterion:
Adult Patients with Overt Hepatic Encephalopathy.

Annotated entities:
- Person: "Adult"
- Condition: "Overt Hepatic Encephalopathy"